Clinical trial inclusion criterion:
Willing to participate in research

Entity relations:
- Has_mood("participate in research", "Willing to")